Any significant co-morbidities, such as active heart, kidney, or liver diseases, accelerated or malignant hypertension, heart failure, severe anemia.

The above is a clinical trial exclusion criterion. Annotated with entity spans:
Any [Qualifier: significant] [Condition: co-morbidities], such as [Qualifier: active] heart, kidney, or [Condition: liver diseases], [Qualifier: accelerated] or [Qualifier: malignant] [Condition: hypertension], [Condition: heart failure], [Condition: severe anemia].